下列與骨重塑作用（bone remodeling）之相關敘述，何者錯誤？
A. 是調節細胞外液鈣磷平衡的重要機轉
B. 噬骨細胞（osteoclast）是從纖維母細胞（fibroblast）分化而來，具多核及吞噬功能
C. 造骨細胞（osteoblast）會分泌製造第一型膠原蛋白
D. 骨重塑作用會受到血中副甲狀腺濃度所調控

正確答案：B. 噬骨細胞（osteoclast）是從纖維母細胞（fibroblast）分化而來，具多核及吞噬功能